What are 7 symptoms of yellow fever?

Yellow fever is considered to be a hemorrhagic fever and illness is characterized by fever, headache, myalgia, gastrointestinal symptoms, hepatic and renal dysfunction, multi-organ failure,  shock and coagulopathy.